¿Por qué núcleo del tálamo se trasmite la información visual?:
1. Núcleo pulvinar.
2. Núcleo arqueado.
3. Núcleo geniculado lateral.
4. Núcleo geniculado medial.
5. Núcleo ventrolateral.

Respuesta correcta: 3. Núcleo geniculado lateral.